Clinical trial inclusion criterion:
presence of stress urinary or urgency incontinence

Entity relations:
- OR("stress urinary incontinence", "urgency incontinence")